Clinical trial inclusion criterion:
English speaking

Annotated entities:
- Observation: "English speaking"